下列有關呼吸衰竭（respiratory failure）之敘述，何者錯誤？
A. 一般以動脈血中的氣體（如氧氣、二氧化碳）分壓為判斷標準
B. 肺纖維化（idiopathic pulmonary fibrosis）是屬於第一類（type I）呼吸衰竭，又稱氧合衰竭（oxygenation failure）
C. 重度慢性阻塞性肺疾（chronic obstructive pulmonary disease）是屬於第二類（type II）呼吸衰竭，又稱換氣衰竭
D. 第一類（type I）呼吸衰竭的低血氧症皆能經由氧氣治療（oxygen therapy）得到改善

正確答案：D. 第一類（type I）呼吸衰竭的低血氧症皆能經由氧氣治療（oxygen therapy）得到改善